Uterine abnormality

The above is a clinical trial exclusion criterion. Annotated with entity spans:
[Condition: Uterine abnormality]